History of renal insufficiency or requiring dialysis.

The above is a clinical trial exclusion criterion. Annotated with entity spans:
[Temporal: History] of [Condition: renal insufficiency] or [Mood: requiring] [Procedure: dialysis].